下列何種方式對空氣污染物之控制最有效？
A. 隔離
B. 取代
C. 濕式作業
D. 集塵設施

正確答案：B. 取代